Subjects who have had an adequate trial of pregabalin.

The above is a clinical trial exclusion criterion. Annotated with entity spans:
[Competing_trial: Subjects who have had an adequate trial of pregabalin].